Clinical trial exclusion criterion:
Prisoner Status

Annotated entities:
- Person: "Prisoner"